下列那一條神經受損，會造成肘關節屈曲（flexion）無力？
A. 肌皮神經（musculocutaneous nerve）
B. 正中神經（median nerve）
C. 尺神經（ulnar nerve）
D. 橈神經（radial nerve）

正確答案：A. 肌皮神經（musculocutaneous nerve）